Able and willing to personally comply with and execute all aspects of the study requirements for the caregivers or guardians

The above is a clinical trial inclusion criterion. Annotated with entity spans:
[Observation: Able] and [Observation: willing to personally comply] with and execute all aspects of the study requirements for the [Person: caregivers] or [Person: guardians]